¿Para qué trastorno se emplea frecuentemente la técnica del desvanecimiento estimular?
1. La enuresis.
2. El mutismo selectivo.
3. El asma infantil.
4. El trastorno por estrés postraumático secundario a abuso sexual.
5. La encopresis.

Respuesta correcta: 2. El mutismo selectivo.